Clinical trial exclusion criteria:
Psychosis
Tourette syndrome
Intelligence quotient (IQ) < 70
Pervasive developmental disorder (PDD)

Annotated entities:
- Condition: "Psychosis"
- Condition: "Tourette syndrome"
- Measurement: "Intelligence quotient"
- Measurement: "IQ"
- Value: "< 70"
- Condition: "Pervasive developmental disorder"
- Condition: "PDD"